Clinical trial exclusion criterion:
Comorbidities that can be associated with elevated natriuretic peptide (NP) levels: renal insufficiency, (eGFR < 25 ml/min/1.73 m² calculated according to MDRD formula), recent (less than 3 months) cerebral trauma or recent (less than 3 months) cerebrovascular incident, novel diagnosis or acute exacerbation of COPD within the last 3 months.

Annotated entities:
- Condition: "Comorbidities"
- Measurement: "natriuretic peptide levels"
- Measurement: "NP"
- Value: "elevated"
- Condition: "renal insufficiency"
- Measurement: "eGFR"
- Value: "< 25 ml/min/1.73 m²"
- Condition: "cerebral trauma"
- Temporal: "less than 3 months"
- Condition: "cerebrovascular incident"
- Temporal: "less than 3 months"
- Condition: "acute exacerbation of COPD"
- Temporal: "last 3 months"